子宮向前傾主要由下列何者牽引所造成？
A. 懸韌帶
B. 卵巢韌帶
C. 子宮圓韌帶
D. 子宮薦韌帶

正確答案：C. 子宮圓韌帶